What is the chromosomal location of the LDL receptor gene associated with autosomal dominant Familial Hypercholesterolemia?

The primary defect is a mutation in the gene encoding for the plasma LDL receptor located on the short arm of chromosome 19.